Age from birth to 21 years

The above is a clinical trial inclusion criterion. Annotated with entity spans:
[Person: Age] [Value: from birth to 21 years]